Clinical trial exclusion criterion:
Cigarette smoker

Annotated entities:
- Observation: "Cigarette smoker"